Clinical trial exclusion criterion:
Presence of inflammatory arthropathy or neuropathy

Entity relations:
- OR("inflammatory arthropathy", "neuropathy inflammatory")